Clinical trial exclusion criterion:
16. Severe anemia (Hb <10 mg/dL).

Annotated entities:
- Parsing_Error: "16."
- Condition: "anemia"
- Qualifier: "Severe"
- Measurement: "Hb"
- Value: "<10 mg/dL"